Clinical trial inclusion criterion:
Gestational age >33 weeks at time of delivery

Entity relations:
- Has_value("Gestational age", ">33 weeks")
- Has_temporal("Gestational age", "at time of delivery")